有關肝性腦病變（hepatic encephalopathy）的敘述，下列何者錯誤？
A. 臨床症狀可以是行為改變或手部顫動（flapping tremor）
B. 應多吃高蛋白食物以補充體力
C. 常因胃腸道出血而誘發
D. 血中氨（ammonia）濃度常升高

正確答案：B. 應多吃高蛋白食物以補充體力